Known allergy to both xanthine oxidase inhibitors and rasburicase.

The above is a clinical trial exclusion criterion. Annotated with entity spans:
Known [Condition: allergy] to both [Drug: xanthine oxidase inhibitors] and [Drug: rasburicase].